Clinical trial inclusion criterion:
BMI between 20 and 34 kg/m2

Entity relations:
- Has_value("BMI", "between 20 and 34 kg/m2")